你收集因申請死亡給付的死亡證書來研究某公司的死亡情形；利用死亡分率研究（Proportional mortality study）發現此公司在多數癌症死亡的分率增加，而心臟血管疾病的分率減少。對此種死亡分率研究，下列何者描述可能最正確：
A. 某種原因的死亡分率與其他原因是獨立的（Independent）
B. 更完整的找出所有死亡病例並不會影響結果
C. 某種原因的增加可導致其他原因的減少
D. 高估潛在危險人數將導致死亡分率比的減少

正確答案：C. 某種原因的增加可導致其他原因的減少